8. Pap smear result at screening that requires cryotherapy, biopsy, treatment (other than for infection), or further evaluation

The above is a clinical trial exclusion criterion. Annotated with entity spans:
8. [Measurement: Pap smear] result [Temporal: at screening] that [Value: requires cryotherapy], [Procedure: biopsy], [Procedure: treatment] (other than for infection), or [Procedure: further evaluation]